下列何者不是低頻率的心音？
A. 第三心音
B. 第四心音
C. 二尖瓣狹窄（Mitral stenosis）導致之舒張期雜音
D. 主動脈瓣閉鎖不全（Aortic regurgitation）導致之舒張期雜音

正確答案：D. 主動脈瓣閉鎖不全（Aortic regurgitation）導致之舒張期雜音